What is resistin?

Resistin, a pro-inflammatory cytokine,